Has used e-cigarettes and marijuana <1 years

The above is a clinical trial exclusion criterion. Annotated with entity spans:
Has [Observation: used e-cigarettes] and marijuana [Temporal: <1 years]